Clinical trial inclusion criterion:
9. No pain(including dysmenorrhea) or drug use (e.g., antipyretics,sleeping pills) within the last month

Entity relations:
- AND("dysmenorrhea", "pain")
- Has_negation("pain", "No")
- Has_temporal("drug", "last month")
- OR("pain", "drug")